Fluent in written and spoken English

The above is a clinical trial inclusion criterion. Annotated with entity spans:
[Non-query-able: Fluent in written and spoken English]